Clinical trial inclusion criterion:
Treated with nasal CPAP modalities = 5 cm H2O and FiO2 between 0.30 and 0.60 for at least 2 hours to maintain SpO2 90-95%;

Entity relations:
- Has_value("SpO2", "90-95%")
- Has_value("nasal CPAP", "= 5 cm H2O")
- AND("nasal CPAP", "FiO2")
- Has_value("FiO2", "between 0.30 and 0.60")
- Has_temporal("nasal CPAP", "for at least 2 hours")
- AND("nasal CPAP", "SpO2")